Previous hyperresponse with OHSS development

The above is a clinical trial exclusion criterion. Annotated with entity spans:
[Temporal: Previous] [Condition: hyperresponse] with [Observation: OHSS development]